Clinical trial inclusion criterion:
Fluency in English spoken language

Annotated entities:
- Non-query-able: "Fluency in English spoken language"